Clinical trial exclusion criterion:
Has other dermatological conditions that may interfere with clinical assessments

Annotated entities:
- Subjective_judgement: "Has other dermatological conditions that may interfere with clinical assessments"